生理回饋治療（bio-feedback）中的自我鬆弛訓練（relaxation therapy），較不適用於下列那一種狀況？
A. 睡眠障礙
B. 氣喘
C. 注意力不足過動症（attention-deficit/hyperactivity disorder）
D. 緊張性頭痛

正確答案：C. 注意力不足過動症（attention-deficit/hyperactivity disorder）